Subject has a current chemical/alcohol dependency or significant psychosocial disturbance.

The above is a clinical trial exclusion criterion. Annotated with entity spans:
Subject has a current [Condition: chemical]/[Condition: alcohol dependency] or [Qualifier: significant] [Condition: psychosocial disturbance].